Clinical trial exclusion criterion:
Known to be hypersensitivity to Bisoprolol, or any of the excipient.

Annotated entities:
- Condition: "hypersensitivity"
- Drug: "Bisoprolol"
- Drug: "excipient"
- Qualifier: "any"